Prostate cancer patients with a rise in PSA under hormone therapy.

The above is a clinical trial inclusion criterion. Annotated with entity spans:
[Condition: Prostate cancer] patients with a [Value: rise] in [Measurement: PSA] under [Procedure: hormone therapy].